Subjects with diseases of the central nervous system that may impact the assessment of the psychotic symptoms as per investigator's opinion.

The above is a clinical trial exclusion criterion. Annotated with entity spans:
[Post-eligibility: Subjects with diseases of the central nervous system that may impact the assessment of the psychotic symptoms as per investigator's opinion.]